Clinical trial inclusion criterion:
Patients may have any of the following indications for cardiac catheterization: Thoracic pain under study. Stable chronic coronary disease. Acute myocardial infarction with ST segment elevation, not perfused (without timely reperfusion therapy) with less than 4 weeks of evolution. Acute myocardial infarction with ST-segment elevation, successful thrombolytic therapy, which will undergo drug-invasive therapy. Acute myocardial infarction without ST segment elevation. Unstable angina. Any acute coronary syndrome, to intervene non-infarct-related artery. Disease of any heart valve. Myocarditis or pericarditis. Dilated cardiomyopathy. Patients in renal or cardiac transplantation protocol for any etiology. Congenital heart disease that requires knowing the coronary anatomy prior to surgical correction.

Annotated entities:
- Procedure: "cardiac catheterization"
- Condition: "indications"
- Condition: "Thoracic pain"
- Qualifier: "Stable"
- Condition: "chronic coronary disease"
- Condition: "Acute myocardial infarction"
- Condition: "ST segment elevation"
- Procedure: "reperfusion therapy"
- Qualifier: "timely"
- Negation: "without"
- Temporal: "with less than 4 weeks of evolution"
- Reference_point: "evolution"
- Condition: "Acute myocardial infarction"
- Condition: "ST-segment elevation"
- Procedure: "thrombolytic therapy"
- Qualifier: "successful"
- Mood: "will undergo"
- Procedure: "drug-invasive therapy"
- Condition: "Acute myocardial infarction"
- Negation: "without"
- Condition: "ST segment elevation"
- Condition: "Unstable angina"
- Condition: "acute coronary syndrome"
- Procedure: "intervene"
- Qualifier: "artery"
- Qualifier: "non-infarct-related"
- Condition: "Disease"
- Qualifier: "heart valve"
- Condition: "Myocarditis"
- Condition: "pericarditis"
- Condition: "cardiomyopathy"
- Qualifier: "Dilated"
- Condition: "cardiac transplantation"
- Condition: "renal transplantation"
- Condition: "Congenital heart disease"
- Qualifier: "knowing the coronary anatomy"
- Temporal: "prior to surgical correction."
- Reference_point: "surgical correction"